下列有關慢性胰臟炎之敘述，何者錯誤？
A. 酗酒為主因
B. 不會增加胰臟癌的發生率
C. 腹部 X-光片胰臟部位常有鈣化點顯示
D. 患者胰臟若已遭受嚴重破壞，會出現 steatorrhea

正確答案：B. 不會增加胰臟癌的發生率